Clinical trial inclusion criterion:
increased risk of bradycardia events (Sick Sinus, AV block grade II or III, bradycardia-induced syncope)

Annotated entities:
- Condition: "bradycardia events"
- Mood: "increased risk"
- Condition: "Sick Sinus"
- Condition: "AV block"
- Measurement: "grade"
- Value: "II or III"
- Condition: "bradycardia-induced syncope"